Clinical trial exclusion criterion:
History of bilateral severe renal artery stenosis and 7) History of angioedema related to previous ACE-inhibitor treatment or known hypersensitivity to ramipril or other ACE inhibitors.

Annotated entities:
- Temporal: "History"
- Qualifier: "bilateral"
- Qualifier: "severe"
- Condition: "renal artery stenosis"
- Temporal: "History"
- Condition: "angioedema"
- Temporal: "previous"
- Procedure: "ACE-inhibitor treatment"
- Drug: "ACE-inhibitor"
- Qualifier: "known"
- Condition: "hypersensitivity"
- Drug: "ramipril"
- Drug: "ACE inhibitors"